關於慢性阻塞性肺病（COPD）病患的呼吸運動訓練，下列何者敘述最正確？
A. 多使用胸式呼吸
B. 吸氣的時間要比呼氣的時間長
C. 使用圓唇吐氣的方式
D. 使用腹式呼吸時，吸氣時腹部須用力下壓

正確答案：C. 使用圓唇吐氣的方式